Evidence of current severe major depressive disorder or suicidal ideation

The above is a clinical trial exclusion criterion. Annotated with entity spans:
Evidence of current [Qualifier: severe] [Condition: major depressive disorder] or [Condition: suicidal ideation]